Clinical trial exclusion criterion:
signs of complicated UTI (e. g. temperature > 38°C, loin tenderness)

Entity relations:
- Has_value("temperature", "> 38°C")
- Subsumes("complicated UTI", "temperature")
- OR("temperature", "loin tenderness")